Clinical trial exclusion criterion:
Are ineligible to take the antiarrhythmic drug to which they would be assigned due to allergy, intolerance or contraindication

Entity relations:
- AND("allergy", "antiarrhythmic drug")
- OR("allergy", "intolerance", "contraindication")